40 歲成人在下列何種情況，不需要優先選擇做大腸纖維內視鏡檢查？
A. 大便潛血反應陽性者
B. 有大腸癌家族史者
C. 長期便秘者
D. 有大腸瘜肉（polyp）病史者

正確答案：C. 長期便秘者